Inability to participate or attend biweekly 30 minute session over 14 weeks

The above is a clinical trial exclusion criterion. Annotated with entity spans:
[Non-query-able: Inability to participate or attend biweekly 30 minute session over 14 weeks]